Clinical trial inclusion criterion:
Subject's parent or legal guardian gives informed consent and subject gives assent.

Annotated entities:
- Post-eligibility: "Subject's parent or legal guardian gives informed consent and subject gives assent."